Clinical trial inclusion criterion:
unprotected sex (in past 6 months) with 1 or more men of unknown HIV status

Entity relations:
- Has_multiplier("men of unknown HIV status", "1 or more")
- Has_temporal("unprotected sex", "in past 6 months")
- AND("unprotected sex", "men of unknown HIV status")